一位 25 歲女性送至急診室時，左手腕掌面橈側有約 3 公分橫向刀口，神經學檢查發現手掌五指可伸 直及併指，但無法彎曲握拳，且手指腹面有麻木感，則此病人主要應為下列那一條神經受損？
A. 尺神經（ulnar nerve）
B. 橈神經（radial nerve）
C. 正中神經（median nerve）
D. \ 指神經（digital nerve）

正確答案：C. 正中神經（median nerve）